Head trauma

The above is a clinical trial exclusion criterion. Annotated with entity spans:
[Condition: Head trauma]